State after kidney transplantation

The above is a clinical trial exclusion criterion. Annotated with entity spans:
[Condition: State after kidney transplantation]